En la Oficina de Farmacia entran cuatro pacientes con recetas y adquieren el mismo medicamento de 30 € con cícero ¿quién paga menos?:
1. Parado con subsidio.
2. Mutualidad General de Funcionarios Civiles del Estado (MUFACE).
3. Trabajador activo.
4. Pensionistas con pensión no contributiva.

Respuesta correcta: 4. Pensionistas con pensión no contributiva.